下列何種新型藥物可轉化為 melagatran，並直接抑制 thrombin 之作用，可使用於 deep venous thrombosis，且較 warfarin 安全，惟其有影響肝功能之副作用？
A. Ximelagatran
B. Lepirudin
C. Tenecteplase
D. Abciximab

正確答案：A. Ximelagatran